Alcohol dehydrogenase（EC 1.1.1.1）催化乙醇（alcohol）及 aldehyde 之反應，屬於何種反應型態？
A. 轉移酶（transferase）
B. 氧化還原酶（oxidoreductase）
C. 水解酶（hydrolase）
D. 連接酶（ligase）

正確答案：B. 氧化還原酶（oxidoreductase）